Which test is used for the definition of colour-blindness?

12 patients had color blindness based on the Ishihara test.